85歲男性被發現左心室血液外流阻力增加及同心性左心肥大，病人因此接受主動脈瓣置換，病理檢查時在手術切除的瓣膜上發現有許多小結狀鈣化結構於sinus of Valsalva中。此病人主動脈瓣在未發生病變前的解剖構造最可能是：
A. three-cuspid valve
B. two-cuspid valve
C. un-commissural valve
D. fissured valve

正確答案：A. three-cuspid valve